腦膜瘤復發（Recurrence of meningiomas）最重要的因素是那一個？
A. 病患年齡（Age of the patient）
B. 骨骼侵犯（Bone invasion）
C. 良性腦膜瘤的組織學分類（Histological type of benign meningioma）
D. 手術後的腫瘤殘留（Postoperative tumor residual）

正確答案：D. 手術後的腫瘤殘留（Postoperative tumor residual）